一位 40 歲女性，因雙側下肢水腫，氣促，呼吸困難來門診就診，身體診查發現雙側肺囉音，心音聽診有 S3 gallop，心臟超音波顯示左心室射出分率為 23%，中度二尖瓣及三尖瓣逆流，下列敘述何者錯誤？
A. B-type natriuretic peptide（BNP）或者 N-terminal pro-BNP 可做為評估疾病嚴重度的指標
B. 飲食的衛教方面應該限鹽，一天小於 2 至 3 克
C. 使用乙型阻斷劑（beta-blockers）對病人預後有幫助，應立即開始使用
D. 當病人已接受合理的藥物治療後仍有症狀，且心電圖顯示 QRS>120 msec 時，應該考慮 cardiac

正確答案：C. 使用乙型阻斷劑（beta-blockers）對病人預後有幫助，應立即開始使用